Remains hospitalized after birth (has never been discharged home)

The above is a clinical trial inclusion criterion. Annotated with entity spans:
Remains [Observation: hospitalized] [Temporal: after birth] (has never been discharged home)